Clinical trial exclusion criterion:
Acute disease at the time of enrolment.

Annotated entities:
- Condition: "Acute disease"
- Temporal: "at the time of enrolment"